Clinical trial exclusion criterion:
Pregnancy and breast feeding mother;

Entity relations:
- OR("Pregnancy", "breast feeding")